Clinical trial inclusion criterion:
Severe or uncontrolled infection.

Entity relations:
- Has_qualifier("infection", "Severe")
- OR("Severe", "uncontrolled")